Clinical trial inclusion criterion:
healthy parturients with uncomplicated, single gestation pregnancies, full term (38-42 weeks of gestation) pregnancy, agreed to participate

Annotated entities:
- Condition: "healthy"
- Person: "parturients"
- Qualifier: "uncomplicated"
- Qualifier: "single gestation"
- Condition: "pregnancies"
- Qualifier: "full term"
- Condition: "pregnancy"
- Value: "38-42"
- Measurement: "weeks of gestation"
- Informed_consent: "agreed to participate"